二尖瓣瓣膜置換時，在後葉的環部（annulus of posterior leaflet）下針時不可太深以免傷及那一個構造？
A. 左迴旋支冠狀動脈
B. 主動脈的瓣葉
C. 房室結
D. 支氣管

正確答案：A. 左迴旋支冠狀動脈